Clinical trial exclusion criterion:
Estimated life expectancy < 1 year from conditions other than TR.

Annotated entities:
- Observation: "Estimated life expectancy"
- Value: "< 1 year"